Clinical trial exclusion criterion:
Any therapeutic invasive cardiac procedure resulting in a permanent implant that is performed within 30 days of the index procedure. Examples of permanent implant would include any new heart valve. Implantation of a permanent pacemaker is excluded.

Annotated entities:
- Procedure: "cardiac procedure"
- Qualifier: "invasive"
- Qualifier: "therapeutic"
- Device: "permanent implant"
- Temporal: "within 30 days of the index procedure"
- Reference_point: "the index procedure"
- Device: "heart valve"
- Device: "permanent pacemaker"
- Negation: "excluded"